Clinical trial exclusion criterion:
History of neurologic disease

Annotated entities:
- Condition: "neurologic disease"
- Temporal: "History"